Clinical trial exclusion criterion:
high blood pressure (>160/100mmHg)

Entity relations:
- Has_value("blood pressure", ">160/100mmHg")
- Subsumes("high blood pressure", "blood pressure")
- multi("high blood pressure", "blood pressure")